Clinical trial inclusion criterion:
Fluent in written and spoken English

Annotated entities:
- Non-query-able: "Fluent in written and spoken English"